Clinical trial inclusion criterion:
Clinical symptoms suggestive of pharyngitis with MC Isaac score =3

Entity relations:
- Has_value("MC Isaac score", "=3")
- Has_mood("pharyngitis", "Clinical symptoms suggestive of")
- AND("pharyngitis", "MC Isaac score")